Clinical trial exclusion criterion:
Prior treatment with a bisphosphonate

Annotated entities:
- Drug: "bisphosphonate"
- Temporal: "Prior"